Clinical trial inclusion criterion:
Age: 18 to 65 years

Annotated entities:
- Person: "Age"
- Value: "18 to 65 years"